What is masitinib an inhibitor of?

Masitinib is an inhibitor of mast cell-glia axis and a Fyn kinase blocker.  It is an oral tyrosine kinase inhibitor with activity against c-Kit and platelet-derived growth factor receptors (PDGFR).